Clinical trial exclusion criterion:
situation in which the procalcitonin concentration could be increased without correlation to an infectious process (poly-traumatised patients,

Annotated entities:
- Measurement: "procalcitonin concentration"
- Qualifier: "increased"
- Condition: "poly-traumatised"